Clinical trial inclusion criterion:
Patient (or the legal guardian if under guardian adult patient) has signed the informed consent form.

Annotated entities:
- Informed_consent: "Patient (or the legal guardian if under guardian adult patient) has signed the informed consent form"